Clinical trial inclusion criterion:
Males and females of 18 years of age or older at the time of the vaccination

Entity relations:
- multi("vaccination", "vaccination")
- Has_index("at the time of the vaccination", "vaccination")
- Has_value("age", "18 years or older")
- Has_temporal("age", "at the time of the vaccination")
- OR("Males", "females")